NO ocurre durante la apoptosis:
1. Rotura de la membrana plasmática.
2. Condensación de la cromatina.
3. Colapso del citoesqueleto.
4. Fragmentación del ADN.
5. Formación de cuerpos apoptóticos.

Respuesta correcta: 1. Rotura de la membrana plasmática.